Clinical trial exclusion criterion:
Hepatitis B or C carrier status

Annotated entities:
- Condition: "Hepatitis B carrier"
- Condition: "Hepatitis C carrier"